Unresectable (locally advanced) stage IIIa or IIIb disease

The above is a clinical trial inclusion criterion. Annotated with entity spans:
[Qualifier: Unresectable] ([Qualifier: locally advanced]) [Condition: stage IIIa] or IIIb disease